肝衰竭伴隨小、軟、鬱血而莢膜皺褶的肝臟，可見於何種情況：
A. 大塊性壞死（massive necrosis）
B. 肝硬化（liver cirrhosis）
C. 懷孕期急性脂肪肝（acute fatty liver of pregnancy）
D. 慢性活動性肝炎（chronic active hepatitis）

正確答案：A. 大塊性壞死（massive necrosis）